Clinical trial exclusion criterion:
indications to dual antiplatelet therapy other than atrial fibrillation or left atrial appendage occlusion at the time of enrollment or predicted appearance of such indications within the duration of the trial (eg. coronary artery disease)

Annotated entities:
- Procedure: "dual antiplatelet therapy"
- Negation: "other than"
- Condition: "atrial fibrillation"
- Condition: "indications"
- Condition: "left atrial appendage occlusion"
- Temporal: "at the time of enrollment"
- Mood: "predicted appearance"
- Temporal: "within the duration of the trial"
- Condition: "coronary artery disease"